Clinical trial exclusion criterion:
pregnancy,

Annotated entities:
- Condition: "pregnancy"